Clinical trial exclusion criterion:
Congestive heart failure (NYHA II-IV).

Entity relations:
- Has_value("NYHA", "II-IV")
- AND("Congestive heart failure", "NYHA")